Clinical trial inclusion criterion:
outpatients aged 18-70 years

Annotated entities:
- Visit: "outpatients"
- Person: "aged"
- Value: "18-70 years"